Patients who cannot or do not want to give informed consent (including language barriers)

The above is a clinical trial exclusion criterion. Annotated with entity spans:
Patients who [Negation: cannot] or [Negation: do not want to] [Observation: give informed consent] (including [Observation: language barriers])